lack of fluency in English

The above is a clinical trial exclusion criterion. Annotated with entity spans:
[Non-query-able: lack of fluency in English]